¿Cuál es el principal factor de riesgo en la aparición del ICTUS isquémico o hemorrágico?
1. Cardiopatía.
2. Diabetes Mellitus.
3. Hiperlipemia.
4. Hipertensión arterial.
5. Obesidad.

Respuesta correcta: 4. Hipertensión arterial.